Clinical trial inclusion criterion:
No previous use of vitamin D.

Annotated entities:
- Negation: "No"
- Temporal: "previous"
- Value: "vitamin D"